Clinical trial exclusion criterion:
Patients with a self-described allergy to ASA, acetaminophen, NSAIDS and codeine.

Entity relations:
- AND("allergy", "ASA")
- OR("ASA", "codeine", "acetaminophen", "NSAIDS")